手術前告知同意的內容不包括那一項？
A. 手術的內容步驟及可能的結果
B. 手術可能產生的合併症
C. 是否有其他的治療方式
D. 手術團隊輝煌歷史

正確答案：D. 手術團隊輝煌歷史